Clinical trial exclusion criterion:
An initial plasma potassium concentration of lower than 3.0 mmol/L

Entity relations:
- Has_value("plasma potassium concentration", "lower than 3.0 mmol/L")
- Has_multiplier("plasma potassium concentration", "initial")